Diabetic and nondiabetic patients

The above is a clinical trial inclusion criterion. Annotated with entity spans:
[Condition: Diabetic] and [Condition: nondiabetic] patients